有關甲狀舌管囊腫（thyroglossal duct cyst）之敘述，下列何者錯誤？
A. 通常發生在頸部中線，是最常見的先天性頸部腫塊
B. 惡性轉化率極低，最常見的惡性細胞型態是	狀上皮細胞癌（squamous cell carcinoma）
C. 標準的治療方式是Sistrunk手術
D. 先前發生過囊腫感染者，手術後較易復發

正確答案：B. 惡性轉化率極低，最常見的惡性細胞型態是	狀上皮細胞癌（squamous cell carcinoma）